Clinical trial inclusion criterion:
Patient is currently benefiting from the treatment with nilotinib, as determined by the investigator

Entity relations:
- AND("treatment", "nilotinib")
- Has_temporal("treatment", "currently")